Un componente básico de los espectrofotómetros es el monocromador. Su función es:
1. Conectar las distintas longitudes de onda procedentes de la fuente para lograr mayor potencia de luz.
2. Transformar la señal óptica medida por el detector en una señal eléctrica.
3. Dispersar la luz separando las longitudes de onda que la componen y seleccionar una banda estrecha.
4. Amplificar la señal analítica mejorando la relación señal/ruido.
5. Disminuir la potencia del haz de luz para eliminar el ruido de fondo del espectrofotómetro.

Respuesta correcta: 3. Dispersar la luz separando las longitudes de onda que la componen y seleccionar una banda estrecha.